Clinical trial exclusion criterion:
Patients affected by inflammatory bowel disease

Annotated entities:
- Condition: "inflammatory bowel disease"